下列有關腹腔鏡大腸直腸手術的敘述，何者錯誤？
A. 其手術適應症與傳統的開腹式手術一樣
B. 老年人接受腹腔鏡手術也可受益
C. hand-assisted technique 之術後恢復較差
D. port site recurrence 不比開腹手術在 incision site 的 recurrence 多

正確答案：C. hand-assisted technique 之術後恢復較差